Clinical trial exclusion criterion:
Patients with baseline dementia

Entity relations:
- Has_temporal("dementia", "baseline")